Clinical trial inclusion criteria:
Nonsurgical neonates and babies up to age 6 months with INR 1.5 or more who are deemed clinically to need plasma infusion.

Annotated entities:
- Person: "neonates"
- Condition: "Nonsurgical"
- Person: "babies"
- Value: "up to age 6 months"
- Person: "age"
- Measurement: "INR"
- Value: "1.5 or more"
- Procedure: "plasma infusion"
- Condition: "need"